Clinical trial inclusion criterion:
Aged 18-80 years.

Annotated entities:
- Person: "Aged"
- Value: "18-80 years"